What are the five traits associated with metabolic syndrome?

Metabolic syndrome (MetS) is a disorder of energy utilization and storage, diagnosed by a co-occurrence of three out of five of the following medical conditions: abdominal (central) obesity, insulin resistance, hypertension, dyslipidemia and hyperglycemia.